一位 30 歲年輕女性被診斷患有鏈球菌（Streptococcus）咽喉炎，數日後在兩小腿脛前，出現數顆壓痛的紅色結節，下列敘述何者錯誤？
A. 依照病史，需考慮結節性紅斑（erythema nodosum）
B. 皮膚病灶通常不會產生潰瘍
C. 發炎細胞的浸潤主要發生在皮下脂肪組織，以 lobular panniculitis 為主
D. 除治療咽喉炎外，應臥床休息並考慮使用 NSAIDs 治療

正確答案：C. 發炎細胞的浸潤主要發生在皮下脂肪組織，以 lobular panniculitis 為主